Clinical trial exclusion criterion:
contraindication to ketamine and lidocaine

Entity relations:
- AND("contraindication", "ketamine")
- OR("ketamine", "lidocaine")